Clinical trial inclusion criterion:
ST-segment elevation acute myocardial infarction patients during the first 12 hours of sympton onset;

Entity relations:
- Has_qualifier("acute myocardial infarction", "ST-segment elevation")
- Has_temporal("acute myocardial infarction", "during the first 12 hours of sympton onset")